休克狀態時，下列那一項生理變化對於組織缺氧惡化的影響最小？
A. 動脈平均血壓由70 mmHg降為50 mmHg
B. 血色素由15 g/dL降為10 g/dL
C. 動脈氧氣分壓由100 mmHg降為70 mmHg
D. 動脈血氧飽和度由100%降為70%

正確答案：C. 動脈氧氣分壓由100 mmHg降為70 mmHg